Dialysis dementia 與下列那種金屬中毒有關？
A. aluminum
B. zinc
C. copper
D. iron

正確答案：A. aluminum